有關體外循環維生系統（extracorporeal life support，又簡稱 ECMO）之敘述，下列何者正確？①對危急病人可提供長期（數月至數年之久）之心肺支持 ②使用於胎便吸入症候群新生兒之存活率低於 50% ③應使用於深度昏迷之危急病人 ④出血為常見併發症
A. ①②③
B. ①③
C. ②④
D. ④

正確答案：D. ④